下列何種藥物可以增強 GABA 在線蟲體及節肢動物之神經-肌肉結合處的作用？
A. Glutamic acid
B. Picrotoxin
C. Pyrimethamine
D. Ivermectin

正確答案：D. Ivermectin